Previous treatment with romiplostim or eltrombopag

The above is a clinical trial exclusion criterion. Annotated with entity spans:
Previous treatment with [Drug: romiplostim] or [Drug: eltrombopag]